Which curated data resources for ChIP-seq data are available?

The MGA repository, Cistrome Data Browser, CR Cistrome and GeneProf data.